Current participation in another clinical study.

The above is a clinical trial exclusion criterion. Annotated with entity spans:
[Non-query-able: Current participation in another clinical study.]